Clinical trial inclusion criterion:
Ischemic and nonischemic etiology

Entity relations:
- OR("Ischemic etiology", "nonischemic etiology")